El diagnóstico de Trastorno delirante de tipo “erotomaniaco” se aplica cuando el tema central:
1. De las alucinaciones, es de tipo erótico.
2. De los delirios, es que otra persona está enamorada del paciente en cuestión.
3. De los delirios, son los celos.
4. De las alucinaciones, implica funciones o sensaciones corporales.
5. De los delirios, implica funciones o sensaciones corporales.

Respuesta correcta: 2. De los delirios, es que otra persona está enamorada del paciente en cuestión.